下列何者不屬於穿膜蛋白-細菌視紫蛋白（bacteriorhodopsin）的特性？
A. 它是利用7個α-螺旋結構形成的通道穿過細胞膜
B. 它是利用單一的β-螺旋結構穿過細胞膜
C. 它是藉由穿膜結構與retinal分子結合
D. 它具有光驅動質子運輸（light-driven proton transport）的功能

正確答案：B. 它是利用單一的β-螺旋結構穿過細胞膜